Subjects with topical and/or systemic medication or mechanical devices that interfere determinedly on the results of the study (such as topical immunomodulators, punctal plugs, corticosteroids, preservative artificial tears, contact lenses).

The above is a clinical trial exclusion criterion. Annotated with entity spans:
Subjects with [Drug: topical] and/or [Drug: systemic medication] or [Device: mechanical devices] that interfere determinedly on the results of the study (such as [Drug: topical immunomodulators], [Device: punctal plugs], [Drug: corticosteroids], [Drug: preservative artificial tears], [Device: contact lenses]).